Right-handed

The above is a clinical trial inclusion criterion. Annotated with entity spans:
[Condition: Right-handed]